Able and willing to comply with all pre-, post-, and follow-up testing and requirements

The above is a clinical trial inclusion criterion. Annotated with entity spans:
[Non-query-able: Able and willing to comply with all pre-, post-, and follow-up testing and requirements]